Un compuesto que transfiere equivalentes reductores desde las mitocondrias al citosol durante la gluconeogénesis es:
1. Fosfoenolpiruvato.
2. Glicerol-3-fosfato.
3. Oxalacetato.
4. Malato.

Respuesta correcta: 4. Malato.